Clinical trial exclusion criterion:
Inborn errors of metabolism

Annotated entities:
- Condition: "Inborn errors of metabolism"